Clinical trial exclusion criterion:
Hepatic insufficiency.

Annotated entities:
- Condition: "Hepatic insufficiency"